Clinical trial inclusion criterion:
M1 (5%) or M2 (= 5% to < 25%) blasts in bone marrow on day 15;

Entity relations:
- Has_value("M2 blasts", "= 5% to < 25%")
- Has_value("M1 blasts", "(5%")
- Has_qualifier("M1 blasts", "bone marrow")
- Has_temporal("M1 blasts", "on day 15")
- OR("M1 blasts", "M2 blasts")